Clinical trial inclusion criterion:
Normal organ function within 14 days of study entry

Entity relations:
- Has_temporal("Normal organ function", "within 14 days of study entry")
- Has_index("within 14 days of study entry", "study entry")